Clinical trial exclusion criterion:
Patient has New York Heart Association (NYHA) class III/IV heart failure.

Entity relations:
- Subsumes("New York Heart Association", "NYHA")
- Has_value("New York Heart Association", "class III/IV")
- AND("heart failure", "New York Heart Association")